單一肺結節（solitary pulmonary nodule）病人，可以不考慮進行切除手術的情況，下列何者錯誤？
A. 此結節經門診追蹤胸部 X 光檢查 2 年，其結節沒有變大
B. 肺結節有良性腫瘤典型的鈣化特徵
C. 肺結核引起的結節
D. 病人有愛滋病

正確答案：D. 病人有愛滋病